La sensibilidad diagnóstica de una magnitud analítica para una determinada enfermedad es:
1. 1/especificidad.
2. Depende de la prevalencia de la enfermedad.
3. Es el número de enfermos que dan resultado positivo entre todos los individuos posibles.
4. Es el cociente entre el número de enfermos que dan resultado positivo para esta magnitud y el número total de enfermos considerados.
5. Se deduce directamente del mínimo valor detectable de esta magnitud.

Respuesta correcta: 4. Es el cociente entre el número de enfermos que dan resultado positivo para esta magnitud y el número total de enfermos considerados.